Aunque en el control neural del refuerzo pueden intervenir diversos neurotransmisores, las neuronas que desempeñan un papel particularmente importante son:
1. Las neuronas colinérgicas de la protuberancia dorsolateral.
2. Las neuronas dopaminérgicas de los sistemas mesolímbico y mesocortical.
3. Las neuronas adrenérgicas del bulbo raquídeo.
4. Las neuronas colinérgicas del prosencéfalo basal.

Respuesta correcta: 2. Las neuronas dopaminérgicas de los sistemas mesolímbico y mesocortical.